List the stages/types of Multiple Sclerosis.

Multiple Sclerosis can be classified into four different stages (A to C), with different types of neurodegenerative disorders such as primary, chronic, relapsing-remitting and progressive forms.